Clinical trial exclusion criterion:
Prolonged cardiopulmonary resuscitation (> 2 minutes) within the past 2 weeks

Annotated entities:
- Condition: "cardiopulmonary resuscitation"
- Qualifier: "Prolonged"
- Temporal: "past 2 weeks"